Clinical trial exclusion criterion:
Contraindication to progestin-only contraceptives

Entity relations:
- AND("contraceptives", "progestin")
- Has_qualifier("progestin", "only")